Hombre de 28 años que es traído a urgencias, un sábado en la madrugada, en estado de agitación psicomotriz y con ideas delirantes. Su acompañante refiere abuso previo, por parte del paciente, de cocaína. ¿Qué signo/síntoma NO esperaría encontrar?
1. Hipotermia.
2. Taquicardia.
3. Midriasis.
4. Diaforesis.
5. Dolor torácico.

Respuesta correcta: 1. Hipotermia.